Clinical trial exclusion criterion:
Treatment with bupropion, varenicline, or nicotine replacement products in the month prior to study inclusion

Entity relations:
- Has_index("in the month prior to study inclusion", "study inclusion")
- AND("Treatment", "bupropion")
- Has_temporal("bupropion", "in the month prior to study inclusion")
- OR("bupropion", "nicotine replacement products", "varenicline")